Clinical trial exclusion criterion:
4. Patients with severe cardiopulmonary cerebral disease, and in the failure state

Annotated entities:
- Condition: "cardiopulmonary cerebral disease"
- Qualifier: "severe"